the patients undergoing ascending, arch and/or proximal descending aorta surgery with cardiopulmonary bypass

The above is a clinical trial inclusion criterion. Annotated with entity spans:
the patients undergoing [Procedure: ascending], [Procedure: arch] and/or [Procedure: proximal descending aorta surgery] with [Procedure: cardiopulmonary bypass]